空氣傳染中之飛沫核大小會影響到它貯積在肺泡中之比例，下列何種直徑之飛沫核較容易進入肺泡？
A. 2000μm
B. 200μm
C. 20μm
D. 2μm

正確答案：D. 2μm